人類的嘔吐中樞（vomiting center）位於何處？
A. 大腦（cerebrum）
B. 小腦（cerebellum）
C. 腦幹（brainstem）
D. 脊髓（spinal cord）

正確答案：C. 腦幹（brainstem）